吳先生因十二指腸潰瘍出血需接受緊急開刀，下列手術術式的選擇何者最不恰當？
A. 潰瘍縫合止血（oversew）
B. 潰瘍縫合止血加高選擇性迷走神經切斷術（oversew and highly selective vagotomy）
C. 潰瘍縫合止血加迷走神經幹切斷術加幽門成形術（oversew with truncal vagotomy and pyloroplasty）
D. 胃竇（含潰瘍）切除術加 Roux-en-Y 胃空腸造口術 （antrectomy with Roux-en-Ygastrojejunostomy）

正確答案：D. 胃竇（含潰瘍）切除術加 Roux-en-Y 胃空腸造口術 （antrectomy with Roux-en-Ygastrojejunostomy）